Clinical trial exclusion criterion:
In France, a subject is neither affiliated with nor a beneficiary of a social security category.

Annotated entities:
- Non-representable: "In France, a subject is neither affiliated with nor a beneficiary of a social security category."